Neurogenic bladder or other neurologic disorder impacting bladder function such as Parkinson's disease, multiple sclerosis, cerebral vascular accident or diabetes

The above is a clinical trial exclusion criterion. Annotated with entity spans:
[Condition: Neurogenic bladder] or other [Condition: neurologic disorder impacting bladder function] such as [Condition: Parkinson's disease], [Condition: multiple sclerosis], [Condition: cerebral vascular accident] or [Condition: diabetes]